下列何種臨床狀況可符合愛滋病（AIDS）的診斷標準？
A. 發生肺囊蟲肺炎（Pneumocystis pneumonia），但愛滋病毒抗體陰性
B. 愛滋病毒抗體陽性，且 CD4 淋巴球數已小於 200 cells/mm3
C. 愛滋病毒抗體陽性，CD4 淋巴球數大於 200 cells/mm3，但病毒量大於 100,000 copies/mL
D. 西方墨點法（Western blot）檢驗愛滋病毒抗體呈現陽性

正確答案：B. 愛滋病毒抗體陽性，且 CD4 淋巴球數已小於 200 cells/mm3